Subject with any current condition believed to have an increased risk of capsule retention such as suspected or known bowel obstruction, stricture, or fistula.

The above is a clinical trial exclusion criterion. Annotated with entity spans:
Subject with any current [Undefined_semantics: condition believed to have an increased risk of capsule retention] such as suspected or known bowel obstruction, stricture, or fistula.